Clinical trial inclusion criterion:
indication of general anesthesia with tracheal intubation

Annotated entities:
- Procedure: "general anesthesia"
- Procedure: "tracheal intubation"
- Mood: "indication"